Clinical trial exclusion criterion:
Patients with chronic liver disease

Entity relations:
- Has_qualifier("liver disease", "chronic")